Indica de qué hueso forma parte el trocánter menor:
1. Peroné.
2. Tibia.
3. Húmero.
4. Fémur.
5. Radio.

Respuesta correcta: 4. Fémur.